剛出生新生兒就有一顆下門牙，下列敘述何者錯誤？
A. 會咬傷母親乳頭
B. 會造成新生兒舌頭磨損
C. 有家族史，常見於下顎骨處
D. 一定要拔掉

正確答案：D. 一定要拔掉